Clinical trial inclusion criterion:
Experiencing GI toxicity from MPA as determined by the treating physician within 12 months post-renal transplant

Annotated entities:
- Procedure: "GI toxicity"
- Drug: "MPA"